Clinical trial exclusion criterion:
2. Unavailability of brain MRI (in case of absolute contraindications, the use of cranial CT is allowed).

Entity relations:
- Has_negation("brain MRI", "Unavailability")
- AND("absolute contraindications", "cranial CT")
- OR("brain MRI", "cranial CT")